Intact fetal membranes

The above is a clinical trial inclusion criterion. Annotated with entity spans:
[Qualifier: Intact] [Condition: fetal membranes]